Clinical trial inclusion criterion:
Females of childbearing potential: negative serum or urine pregnancy test

Annotated entities:
- Person: "Females"
- Condition: "childbearing potential"
- Measurement: "urine pregnancy test"
- Measurement: "serum pregnancy test"
- Value: "negative"